Patients with medical comorbidities preventing them from definitive surgical therapy.

The above is a clinical trial exclusion criterion. Annotated with entity spans:
Patients with [Condition: medical comorbidities] [Mood: preventing them from] [Procedure: definitive surgical therapy].